Clinical trial inclusion criterion:
Met MGH transplant center criteria, listed for liver transplant

Entity relations:
- Has_qualifier("liver transplant", "MGH transplant center criteria")